Allergy against to penicillin or cephalosporins

The above is a clinical trial exclusion criterion. Annotated with entity spans:
[Condition: Allergy] against to [Drug: penicillin] or [Drug: cephalosporins]